下列何者位於會陰深隙（deep perineal pouch）？
A. 會陰淺橫肌
B. 球海綿體肌
C. 陰莖背側神經
D. 坐骨海綿體肌

正確答案：C. 陰莖背側神經